下列那種藥物可用來預防或治療尿毒性出血？
A. heparin
B. aspirin
C. desmopressin（DDAVP）
D. testosterone

正確答案：C. desmopressin（DDAVP）